一位 75 歲男性在不同的靜脈位置交替發生血栓。此種移走性血栓靜脈炎（migratory thrombophlebitis）的現象（亦稱 Trousseau sign），最常併發於下列何種疾病？
A. 胰臟、大腸或肺癌
B. 慢性骨髓炎
C. 鬱血性心臟衰竭
D. 末期腎疾病

正確答案：A. 胰臟、大腸或肺癌